一位 42 歲男性病患，10 年前在化學工廠工作時，因為工安意外，吸入大量 ammonia。當時因為 acute inhalation lung injury 引起 ARDS，住院置入氣管內管及使用呼吸器治療，2 星期後脫離呼吸器，出院回家。但是病患從此患有慢性咳嗽、大量黃痰及漸進性呼吸困難，同時併發反覆肺部感染。下列敘述何者錯誤？
A. 本病患可能之診斷為 toxic gas 吸入引起之支氣管擴張症（bronchiectasis）
B. 這類病患出現黃痰量增多、顏色變深、發燒等症狀時，要懷疑肺部感染，此時應該使用抗生素治療，尤其要考慮 Staphylococcus aureus 感染
C. 這類病患可以接受 respiratory therapy，例如拍痰、姿勢引流等，但是 mucolytic agents 的使用與否尚有爭議
D. 本病患如果出現大量咳血，進行栓塞治療（embolization）會比手術切除適當

正確答案：B. 這類病患出現黃痰量增多、顏色變深、發燒等症狀時，要懷疑肺部感染，此時應該使用抗生素治療，尤其要考慮 Staphylococcus aureus 感染